El mecanismo más frecuente que induce la activación del protooncogen NMYC en el meuroblastoma es:
1. Mutación puntual.
2. Amplificación génica.
3. Deleción.
4. Translocación.

Respuesta correcta: 2. Amplificación génica.